What is Cellbase?

CellBase, a comprehensive collection of RESTful web services for retrieving relevant biological information from heterogeneous sources. CellBase provides a solution to the growing necessity of integration by easing the access to biological data.